Clinical trial exclusion criterion:
moribund patients,

Annotated entities:
- Condition: "moribund"